自發性細菌性腹膜炎（spontaneous bacterial peritonitis）的常見致病細菌為下列那些細菌？
A. 格蘭氏陽性菌與格蘭氏陰性桿菌
B. 格蘭氏陰性桿菌與厭氧菌（anaerobes）
C. 格蘭氏陽性菌與厭氧菌（anaerobes）
D. 蘭氏陽性菌與結核桿菌

正確答案：A. 格蘭氏陽性菌與格蘭氏陰性桿菌